List symptoms of the One-and-a-half syndrome.

One-and-a-half syndrome is defined by conjugated horizontal gaze palsy and internuclear ophthalmoplegia.